Clinical trial exclusion criterion:
Contra-indications for alfa-interferon therapy like suspected hypersensitivity to interferon or Peginterferon or any known pre-existing medical condition that could interfere with the patient's participation in and completion of the study.

Entity relations:
- AND("hypersensitivity", "interferon")
- AND("Contra-indications", "alfa-interferon therapy")
- Subsumes("Contra-indications", "hypersensitivity")
- OR("interferon", "Peginterferon")